Clinical trial inclusion criterion:
Eumenorrheic normo-gonadotropic women

Annotated entities:
- Condition: "Eumenorrheic"
- Condition: "normo-gonadotropic"
- Person: "women"